Clinical trial inclusion criterion:
over 18 years

Annotated entities:
- Value: "over 18 years"
- Person: "over 18 years"